Clinical trial exclusion criterion:
stroke or other cardioembolic event within the 30 days prior to the scheduled procedure;

Entity relations:
- Has_qualifier("cardioembolic event", "other")
- Has_index("within the 30 days prior to the scheduled procedure", "the scheduled procedure")
- Has_temporal("stroke", "within the 30 days prior to the scheduled procedure")
- OR("stroke", "cardioembolic event")